La reacción de ácidos peroxicarboxílicos con el grupo carbonilo de cetonas produce:
1. Ácidos.
2. Ésteres.
3. Alcoholes.
4. Éteres.
5. Amidas.

Respuesta correcta: 2. Ésteres.